一位 17 歲女性病人，診斷罹患下頷下膿瘍（submandibular abscess），需要進行緊急引流手術，理學檢查發現臉部嚴重水腫，張口困難，則下列何者比較可能是處理此病人呼吸道之正確做法？
A. 進行清醒經鼻插管，並請外科醫師陪同，準備氣管切口用品
B. 先進行經氣管及兩側上喉神經阻斷術，以利清醒插管
C. 進行清醒插管容易產生喉痙攣，此時應該輔以少量肌肉鬆弛劑
D. 可以考慮先給予麻醉劑或鎮靜劑後，經環甲膜（cricothyroid membrane）進行逆行性插管

正確答案：A. 進行清醒經鼻插管，並請外科醫師陪同，準備氣管切口用品